Clinical trial exclusion criterion:
Anemia defined as Hemoglobin (Hb) < 115 g/L (7.1 mM) in women and < 120 g/L (7.5 mM) in men.

Entity relations:
- Subsumes("< 115 g/L", "7.1 mM")
- Subsumes("< 120 g/L", "7.5 mM")
- Has_value("men", "< 120 g/L")
- Has_value("women", "< 115 g/L")
- AND("women", "Hemoglobin (Hb)")
- Subsumes("Anemia", "women")
- OR("women", "men")